Clinical trial exclusion criterion:
alpha 1-antitrypsin deficiency: Subjects with known alpha-1 antitrypsin deficiency as the underlying cause of COPD.

Annotated entities:
- Condition: "alpha 1-antitrypsin deficiency"
- Condition: "COPD"
- Condition: "alpha-1 antitrypsin deficiency"